Clinical trial exclusion criterion:
congestive heart failure New York Heart Association (NYHA) III and IV

Entity relations:
- Subsumes("New York Heart Association", "NYHA")
- Has_value("New York Heart Association", "III and IV")
- AND("congestive heart failure", "New York Heart Association")